Clinical trial inclusion criteria:
major depressive episode in type2 bipolar disorder or bipolar disorder NOS.(MADRS more than 20 point)
18years to 65years
subjects who sign the informed consent document

Annotated entities:
- Condition: "major depressive episode"
- Condition: "type2 bipolar disorder"
- Condition: "bipolar disorder"
- Qualifier: "NOS"
- Measurement: "MADRS"
- Value: "more than 20 point"
- Value: "18years to 65years"
- Person: "years"
- Observation: "sign the informed consent"